Clinical trial inclusion criteria:
CHB patients who had received single NAs for more than 12 months.
Hepatitis B e antigen (HBeAg)-negative.
Hepatitis B surface antigen (HBsAg) positive and <1000 IU/mL.
Hepatitis B virus DNA <100 IU/mL.

Annotated entities:
- Drug: "NAs"
- Qualifier: "single"
- Condition: "CHB"
- Temporal: "more than 12 months"
- Measurement: "Hepatitis B e antigen"
- Measurement: "HBeAg"
- Value: "negative"
- Measurement: "Hepatitis B surface antigen"
- Measurement: "HBsAg"
- Value: "positive"
- Value: "<1000 IU/mL"
- Measurement: "Hepatitis B virus DNA"
- Value: "<100 IU/mL"